Uno de los signos que puede aparecer en el postoperatorio es el timpanismo, cuyo significado es:
1. Paralización del peristaltismo intestinal.
2. Perforación timpánica por aumento de la presión.
3. Evisceración.
4. Retención de gases en el intestino.
5. Dolor abdominal intenso.

Respuesta correcta: 4. Retención de gases en el intestino.